Respecto a la EPOC, ¿cuál es FALSA?
1. El hábito tabáquico es el factor más importante para desarrollar EPOC.
2. Contrariamente al asma, no hay componente inflamatorio.
3. El factor genético para desarrollar EPOC mejor documentado es el déficit de alfa1antitripsina.
4. Las acropaquias no son características de la EPOC y su presencia debe sugerir bronquiectasias asociadas o carcinoma broncopulmonar.
5. Espirométricamente, se detecta obstrucción por un cociente FEV1/FVC inferior a 0,70.

Respuesta correcta: 2. Contrariamente al asma, no hay componente inflamatorio.